關於低血糖（hypoglycemia）之敘述，下列何者錯誤？
A. 糖尿病患接受降血糖藥物治療是低血糖最常見的原因
B. Dipeptidyl peptidase IV（DPP-4）抑制劑經由 Glucagon-like peptide-1（GLP-1）刺激胰島素分泌，且抑制昇糖素分泌，是最易造成低血糖的降血糖藥物
C. 雙胍類（biguanide）之 metformin 是較不易造成低血糖的降血糖藥物
D. 併用 α-glucosidase 抑制劑發生低血糖時，要直接口服或注射葡萄糖，不宜單純進食多醣食物

正確答案：B. Dipeptidyl peptidase IV（DPP-4）抑制劑經由 Glucagon-like peptide-1（GLP-1）刺激胰島素分泌，且抑制昇糖素分泌，是最易造成低血糖的降血糖藥物